contraindications to dexmedetomidine

The above is a clinical trial exclusion criterion. Annotated with entity spans:
[Condition: contraindications] to [Drug: dexmedetomidine]